根據first-order kinetics，喝完200毫升開水多久後，胃裡一半的水會排空至十二指腸？
A. 5分鐘
B. 12分鐘
C. 20分鐘
D. 35分鐘

正確答案：B. 12分鐘